Women of childbearing potential must not be pregnant, planning to become pregnant during the study period, or nursing.

The above is a clinical trial exclusion criterion. Annotated with entity spans:
[Person: Women] of [Condition: childbearing potential] must [Negation: not be] [Condition: pregnant], [Mood: planning to become] [Condition: pregnant] [Temporal: during the study period], or [Condition: nursing].